Clinical trial inclusion criteria:
Adult patients (age = 18)
Diagnosed by preoperative imaging modalities to have a brain tumor (including metastatic brain tumors) or vascular lesions (aneurysm, arteriovenous malformation or arteriovenous fistula) requiring surgical intervention.
The patient is determined by a board certified neurosurgeon to have a tumor or vascular lesion that would take up fluorescein
Patient or legally authorized representative provides written informed consent to enroll in this study

Annotated entities:
- Person: "Adult"
- Person: "age"
- Value: "= 18"
- Temporal: "preoperative"
- Procedure: "imaging modalities"
- Condition: "brain tumor"
- Condition: "metastatic brain tumors"
- Condition: "vascular lesions"
- Condition: "aneurysm"
- Condition: "arteriovenous malformation"
- Condition: "arteriovenous fistula"
- Procedure: "surgical intervention"
- Condition: "tumor"
- Condition: "vascular lesion"
- Qualifier: "would take up fluorescein"
- Drug: "fluorescein"
- Informed_consent: "Patient or legally authorized representative provides written informed consent to enroll in this study"